Clinical trial exclusion criterion:
Active autoimmune disease requiring immunosuppressive therapy within 30 days

Entity relations:
- AND("requiring", "immunosuppressive therapy")
- Has_temporal("requiring", "within 30 days")
- Has_temporal("autoimmune disease", "Active")
- OR("autoimmune disease", "requiring")